Clinical trial inclusion criteria:
Any patients that will be submitted to phacoemulsification surgery in the Hospital de Clinicas of State University of Campinas (BRAZIL)
Patients over 18 years old
Patients who are able to perform SD-OCT
Patients who sign the consent form

Annotated entities:
- Procedure: "phacoemulsification surgery"
- Mood: "will be submitted to"
- Visit: "Hospital de Clinicas of State University of Campinas (BRAZIL)"
- Value: "over 18 years"
- Person: "old"
- Mood: "able to perform"
- Procedure: "SD-OCT"
- Informed_consent: "Patients who sign the consent form"